Signed Informed Consent Form (ICF).

The above is a clinical trial inclusion criterion. Annotated with entity spans:
[Post-eligibility: Signed Informed Consent Form (ICF)].